How are immediate early genes (IEG) defined?

this class of genes is experimentally defined by their transcription following primary infection or reactivation in the presence of inhibitors of protein synthesis. Immediate-early (IE) genes are the first class of viral genes expressed after primary infection or reactivation.